Clinical trial exclusion criteria:
Presence of VTE upon admission
Pregnant or nursing
Inability to give informed consent by patient or healthcare proxy
Contraindication to enoxaparin
Contraindication to aspirin
Epidural or subdural hematoma
Presence, or removal within the last 12 hours, of an epidural or spinal catheter, or recent (within the last 12 hours) epidural or spinal anesthesia/procedures

Annotated entities:
- Condition: "VTE"
- Temporal: "upon admission"
- Condition: "Pregnant"
- Condition: "nursing"
- Observation: "Inability to give informed consent"
- Informed_consent: "Inability to give informed consent by patient or healthcare proxy"
- Condition: "Contraindication"
- Drug: "enoxaparin"
- Condition: "Contraindication"
- Drug: "aspirin"
- Condition: "Epidural hematoma"
- Condition: "subdural hematoma"
- Procedure: "removal of an epidural"
- Condition: "Presence of an epidural"
- Temporal: "within the last 12 hours"
- Condition: "Presence of a spinal catheter"
- Procedure: "removal of a spinal catheter"
- Temporal: "recent"
- Temporal: "within the last 12 hours"
- Procedure: "spinal anesthesia"
- Procedure: "epidural anesthesia"